Patients of familial cases of POF :

The above is a clinical trial inclusion criterion. Annotated with entity spans:
[Parsing_Error: Patients of familial cases of POF :]